下列有關甲狀腺之敘述，何者錯誤？
A. 成人 T4 之半衰期約一星期
B. Parafollicular cells 分泌 thyroglobulin
C. 成人 T3 之半衰期約 8 至 12 小時
D. 甲狀腺髓質癌由 parafollicular cells 病變而來

正確答案：B. Parafollicular cells 分泌 thyroglobulin